Clinical trial exclusion criterion:
Creatinine > 1.5 mg/dL

Entity relations:
- Has_value("Creatinine", "> 1.5 mg/dL")